Comorbidities such as uncontrolled cardiovascular disease, i.e., unstable systemic arterial hypertension, coronary artery disease; previous stroke; OSA; pneumothorax in the last 2 months.

The above is a clinical trial exclusion criterion. Annotated with entity spans:
[Condition: Comorbidities] such as [Qualifier: uncontrolled] [Condition: cardiovascular disease], i.e., [Qualifier: unstable] [Condition: systemic arterial hypertension], [Condition: coronary artery disease]; [Qualifier: previous] [Condition: stroke]; [Condition: OSA]; [Condition: pneumothorax] [Temporal: in the last 2 months].